Patients with 2 or more doses of methylprednisolone/prednisone per day

The above is a clinical trial exclusion criterion. Annotated with entity spans:
Patients with [Multiplier: 2 or more doses] of [Drug: methylprednisolone]/[Drug: prednisone] per day